7歲男童發燒、咳嗽3天，肺部聽診兩側有細囉音（fine crackles），經使用cefotaxime 150 mg/kg/day q6h治療3天之後，發燒持續存在，但該男童活力良好，無呼吸窘迫，胸部X光片呈對稱性間質性浸潤。下列那一項處置最適當？
A. 改用cefotaxime 300 mg/kg/day q6h
B. 改用azithromycin 10 mg/kg/day qd
C. 改用vancomycin 40 mg/kg/day q8h
D. 改用penicillin 300,000 units/kg/day q6h

正確答案：B. 改用azithromycin 10 mg/kg/day qd